一位 8 歲男童車禍遭公車撞擊，被送至急診處，到院時男童意識清楚、面容焦慮、呼吸淺快、胸前有大片車輪印及瘀傷，生命徵象顯示呼吸速率 60/分、心跳 180/分、收縮壓 70 mmHg，四肢濕冷、血氧 91%，在影像檢查前，為預防呼吸衰竭，給予預防性氣管插管（prophylactic intubation），插管後給予甦醒球正壓呼吸，卻發現血氧 64%、心搏 32/分，血壓無法測量，呈現無脈性心臟電氣活動（pulseless  electrical activity），插管位置經確定正確，但右側呼吸音消失，下列何者立即處置最恰當？
A. 安排胸部 X 光檢查
B. 給予大量輸液並送入開刀房
C. 給予 100%氧氣之機械換氣，並給予 Atropine 0.2 mg/kg
D. 給予右二肋間胸部針刺放氣

正確答案：D. 給予右二肋間胸部針刺放氣